Clinical trial exclusion criterion:
The patients have severe non-cancerous diseases.

Entity relations:
- Has_qualifier("non-cancerous diseases", "severe")